Clinical trial exclusion criterion:
patients with known allergy to study medications.

Annotated entities:
- Condition: "allergy"
- Drug: "study medications"